Clinical trial inclusion criterion:
(1) intrauterine device in place for at least 3 months prior to the start of the study and remaining in place during the study period, or (2) barrier methods containing or used in conjunction with a spermicidal agent, or (3) postmenopausal accompanied with a documented postmenopausal course of at least one year or surgical sterility (tubal ligation, oophorectomy or hysterectomy).

Entity relations:
- Has_index("for at least 3 months prior to the start of the study", "the start of the study")
- Has_index("in place during the study period", "the study period")
- Has_temporal("intrauterine device", "for at least 3 months prior to the start of the study")
- Has_temporal("intrauterine device", "in place during the study period")
- Has_temporal("postmenopausal", "at least one year")
- Subsumes("surgical sterility", "tubal ligation")
- OR("tubal ligation", "hysterectomy", "oophorectomy")
- OR("intrauterine device", "surgical sterility", "barrier methods", "postmenopausal")